Clinical trial inclusion criterion:
Women above 18 years of age with biopsy proven, clinically stage 1 or 2 breast cancer who will be undergoing partial mastectomy with SLNBx at Memorial Health

Annotated entities:
- Person: "Women"
- Value: "above 18 years"
- Person: "age"
- Condition: "breast cancer"
- Qualifier: "stage 1"
- Qualifier: "stage 2"
- Procedure: "biopsy"
- Procedure: "partial mastectomy"
- Procedure: "SLNBx"
- Visit: "at Memorial Health"
- Mood: "will be undergoing"